Clinical trial exclusion criterion:
Intestinal infection within 2 months before study entry.

Entity relations:
- Has_index("within 2 months before study entry", "study entry")
- Has_temporal("Intestinal infection", "within 2 months before study entry")